assumption of medication that interacts with Truvada®

The above is a clinical trial exclusion criterion. Annotated with entity spans:
[Non-query-able: assumption of medication that interacts with Truvada]®